2. Screening tools: SCID Screen Patient Questionnaire. Potential diagnoses will be further evaluated by a counselor. Drug Use Survey (DUS), Substance Use Disorder Evaluation.

The above is a clinical trial exclusion criterion. Annotated with entity spans:
[Parsing_Error: 2.] [Parsing_Error: Screening tools: SCID Screen Patient Questionnaire.] [Not_a_criteria: Potential diagnoses will be further evaluated by a counselor.] [Not_a_criteria: Drug Use Survey (DUS), Substance Use Disorder Evaluation.]